Clinical trial exclusion criterion:
Intolerability of tamsulosin or related drugs

Annotated entities:
- Condition: "Intolerability"
- Drug: "tamsulosin"
- Drug: "related drugs"